Person who is not wearing prosthesis 8hours/day on average.

The above is a clinical trial exclusion criterion. Annotated with entity spans:
Person who is [Negation: not] wearing [Device: prosthesis] [Multiplier: 8hours/day] on average.